四肢痙攣型的腦性麻痺患者（spastic quadriparesis），因照顧及動作能力上的考量而使用硬脊膜下幫浦（intrathecal baclofen pump）治療，關於此治療方法，下列何者錯誤？
A. 僅對痙攣型具有療效，對肌張力異常（dystonia）不具效用
B. 可以改善姿勢、減少痙攣引起的疼痛
C. 可有效減少行走時消耗的能量
D. 可減少照顧者的不便，且減少手術的必要

正確答案：A. 僅對痙攣型具有療效，對肌張力異常（dystonia）不具效用